Clinical trial inclusion criterion:
An apnea-hypopnea index between 5-30 h-1

Annotated entities:
- Measurement: "apnea-hypopnea index"
- Value: "between 5-30 h-1"